Clinical trial exclusion criterion:
• Investigational medications (30 days or 5 half-lives off drug, whichever is longer)

Entity relations:
- Has_temporal("Investigational medications", "30 days off drug")
- OR("30 days off drug", "5 half-lives off drug")